Clinical trial exclusion criterion:
contraindication against metamizole known or suspected (known or suspected allergy against novalgin or other pyrazolones, anaphylactic reaction against NSAIDS, decreased bone marrow function or hematopoesis, hepatic porphyria, glucose-6-phosphate dehydrogenase deficiency, and pregnancy/breastfeeding)

Annotated entities:
- Condition: "contraindication"
- Drug: "metamizole"
- Qualifier: "known"
- Qualifier: "suspected"
- Qualifier: "known"
- Qualifier: "suspected"
- Condition: "allergy"
- Drug: "novalgin"
- Drug: "pyrazolones"
- Qualifier: "other"
- Condition: "anaphylactic reaction"
- Drug: "NSAIDS"
- Measurement: "bone marrow function"
- Value: "decreased"
- Measurement: "hematopoesis"
- Condition: "hepatic porphyria"
- Condition: "glucose-6-phosphate dehydrogenase deficiency"
- Condition: "pregnancy"
- Observation: "breastfeeding"